杜克氏嗜血桿菌（Haemophilus ducreyi）主要感染人體的那個部位？
A. 生殖器
B. 眼部
C. 鼻咽部
D. 胃腸道

正確答案：A. 生殖器